Clinical trial exclusion criterion:
Current use of either ACE inhibitors or angiotensin II receptor blockers,

Annotated entities:
- Drug: "ACE inhibitors"
- Temporal: "Current use"
- Drug: "angiotensin II receptor blockers"